32 歲女性，因心肌梗塞住入加護病房，二天後出現肋膜腔積水，病人體溫攝氏 37 度，此肋膜腔積水之性質，下列何者最有可能？
A. 比重超過 1.017
B. 屬於漏出液（transudate）
C. 含大量發炎細胞
D. 每公合（dL）之蛋白量超過 4 公克

正確答案：B. 屬於漏出液（transudate）